Which genes of the marmoset genome exhibit rapid sequence evolution?

Both protein-coding and microRNA genes related to reproduction exhibit evidence of rapid sequence evolution in the marmoset genome.